Clinical trial exclusion criterion:
Corneal disease potentially requiring a treatment during the following 3 months

Entity relations:
- Has_mood("treatment", "potentially requiring")
- AND("Corneal disease", "treatment")
- Has_temporal("treatment", "during the following 3 months")